Platelet count < 100,000/ml

The above is a clinical trial exclusion criterion. Annotated with entity spans:
[Measurement: Platelet count] [Value: < 100,000/ml]